Clinical trial exclusion criterion:
Chronic total occlusion (CTO) lesions, in-stent restenosis (ISR)

Annotated entities:
- Condition: "Chronic total occlusion"
- Condition: "CTO"
- Condition: "in-stent restenosis"
- Condition: "ISR"